Clinical trial inclusion criterion:
Children between the ages of 4-18 with incomplete ASIA C or D spinal cord injuries at least 12 months before study enrolment

Annotated entities:
- Person: "ages"
- Value: "4-18"
- Person: "Children"
- Condition: "spinal cord injuries"
- Measurement: "ASIA"
- Value: "C or D"
- Qualifier: "incomplete"
- Temporal: "at least 12 months before study enrolment"
- Reference_point: "study enrolment"